¿Qué aminoácido sirve de partida para la síntesis de porfirinas (grupo hemo)?
1. Valina.
2. Alanina.
3. Asparagina.
4. Lisina.
5. Glicina.

Respuesta correcta: 5. Glicina.